Clinical trial exclusion criterion:
History of liver cirrhosis, chronic kidney disease, malignancy, inflammatory bowel disease, significant infectious disease, polyposis syndrome

Entity relations:
- Has_temporal("liver cirrhosis", "History")
- OR("liver cirrhosis", "chronic kidney disease", "malignancy", "inflammatory bowel disease", "significant infectious disease", "polyposis syndrome")